Clinical trial inclusion criterion:
health medical history

Entity relations:
- Has_qualifier("medical history", "health")